關於黑色素沉著的治療，下列敘述何者錯誤？
A. 若增加的黑色素顆粒在表皮層，使用對苯二酚（hydroquinone）藥膏可有效淡化
B. 若增加的黑色素顆粒在真皮層，使用脈衝光（intense pulsed light, IPL）比釹雅各（Nd:YAG）雷射效果更
C. 若施打雷射的劑量太強或施打太頻繁，容易造成醫源性色素脫失
D. 外用A酸（retinoic acid）藥膏對於雀斑（freckles）有淡化效果

正確答案：B. 若增加的黑色素顆粒在真皮層，使用脈衝光（intense pulsed light, IPL）比釹雅各（Nd:YAG）雷射效果更